Clinical trial inclusion criterion:
7. In the absence of the use of exogenous hormone(s), have a self-reported regular menstrual cycle defined as having a minimum of 21 days and a maximum of 36 days between menses

Entity relations:
- Has_negation("exogenous hormone", "absence")
- multi("regular menstrual cycle", "menstrual cycle")
- Has_value("menstrual cycle", "regular")
- Subsumes("regular", "minimum of 21 days")
- AND("exogenous hormone", "regular menstrual cycle")
- Subsumes("regular", "maximum of 36 days")